¿Cuál de las siguientes modificaciones no forma parte del proceso de maduración que sufren los precursores de los tRNAs?
1. Modificación de bases.
2. Eliminación de la secuencia líder del extremo 5´.
3. Eliminación del segmento final del extremo 3´.
4. Adición de CCA al extremo 3´.
5. Poliadenilación del extremo 3´.

Respuesta correcta: 5. Poliadenilación del extremo 3´.